La cetoacidosis diabética (CAD) produce trastornos del metabolismo de los carbohidratos, proteínas y lípidos. Las principales manifestaciones clínicas de la CAD son:
1. Hipoglucemia, deshidratación con pérdida de electrolitos y acidosis.
2. Hiperglucemia, deshidratación con pérdida de electrolitos y alcalosis.
3. Hipoglucemia, incrementos de la volemia y acidosis.
4. Hiperglucemia, deshidratación con pérdida de electrolitos y acidosis.
5. Hiperglucemia, incrementos de la volemia y alcalosis.

Respuesta correcta: 4. Hiperglucemia, deshidratación con pérdida de electrolitos y acidosis.